Clinical trial exclusion criterion:
Age< 18

Entity relations:
- Has_value("Age", "< 18")